Clinical trial exclusion criterion:
Subject with any underlying cardiovascular condition, including unstable angina pectoris, which preclude sexual activity

Annotated entities:
- Condition: "cardiovascular condition"
- Condition: "unstable angina pectoris"
- Observation: "sexual activity"
- Negation: "preclude"